Clinical trial exclusion criterion:
Unable to undergo brain MRI

Entity relations:
- Has_mood("brain MRI", "Unable to undergo")